Clinical trial exclusion criterion:
4. Pregnant women

Entity relations:
- AND("women", "Pregnant")